En el sistema digestivo, el vago:
1. Estimula la contracción del cardias.
2. Media el reflejo gastro-cólico.
3. Disminuye la secreción de ácido gástrico.
4. Inhibe la secreción de bicarbonato pancreático.
5. No es colagogo.

Respuesta correcta: 2. Media el reflejo gastro-cólico.